Co-infected with HCV, HIV or other viral hepatitis,

The above is a clinical trial exclusion criterion. Annotated with entity spans:
[Temporal: Co-infected] with [Condition: HCV], [Condition: HIV] or [Qualifier: other] [Condition: viral hepatitis],